History of drug sensitivity or allergic reaction to alpha-blockers or beta-blockers

The above is a clinical trial exclusion criterion. Annotated with entity spans:
[Temporal: History] of [Condition: drug sensitivity] or [Condition: allergic reaction] to [Drug: alpha-blockers] or [Drug: beta-blockers]